聯絡兩側大腦新皮質（neocortex）的構造為：
A. 前連合（Anterior commissure）
B. 後連合（Posterior commissure）
C. 穹窿連合（Fornix commissure）
D. 胼胝體（Corpus callosum）

正確答案：D. 胼胝體（Corpus callosum）